Clinical trial exclusion criterion:
Patients with a self-described allergy to ASA, acetaminophen, NSAIDS and codeine.

Annotated entities:
- Condition: "allergy"
- Drug: "ASA"
- Drug: "acetaminophen"
- Drug: "NSAIDS"
- Drug: "codeine"